Clinical trial exclusion criterion:
11. Systolic blood pressure <85 or diastolic blood pressure <55

Annotated entities:
- Measurement: "Systolic blood pressure"
- Value: "<85"
- Measurement: "diastolic blood pressure"
- Value: "<55"